關於胃息肉症（gastric polyposis），下列何者錯誤？
A. 與息肉相關的疾病包括Peutz-Jeghers症候群、Gardner症候群及家族性大腸息肉症
B. 息肉越大惡性機率越小
C. 家族性大腸息肉症有很大的惡性機率
D. 以增生性息肉（hyperplastic polyp）為最常見

正確答案：B. 息肉越大惡性機率越小